有關處方上肢裝具（upper limb orthotics），下列何者不是常見的目的？
A. 提供因疾病造成無力肌肉的肌力訓練（strengthen for weak or absent muscles）
B. 藉由限制活動或受力來保護受傷的區段（protect damaged or diseased segments by limiting load or  motion）
C. 避免變形或矯正攣縮（prevention of deformity or correction of contracture）
D. 可連接其他輔具，輔助日常生活功能

正確答案：A. 提供因疾病造成無力肌肉的肌力訓練（strengthen for weak or absent muscles）